Histologically confirmed diagnosis of melanoma, breast cancer or gynecologic cancer at MSKCC

The above is a clinical trial inclusion criterion. Annotated with entity spans:
[Procedure: Histologically] [Value: confirmed] diagnosis of [Condition: melanoma], [Condition: breast cancer] or [Condition: gynecologic cancer] at [Visit: MSKCC]